Clinical trial exclusion criterion:
patients with comorbidities (heart failure congestive, chronic obstructive pulmonary disease);

Entity relations:
- Subsumes("comorbidities", "heart failure congestive")
- OR("heart failure congestive", "chronic obstructive pulmonary disease")